Which part of the TNFR2 gene is genetically associated with Systemic Lupus Erythematosus?

A tnfr2 3' flanking region polymorphism in systemic lupus erythematosus has been shown to be significantly associated with selenocytoplasmic lupus erythematotosus. No transmission distortion was observed for tnpr2-196r allele.